Gastrectomy, biliopancreatic diversion, resection or re-routing of small intestines

The above is a clinical trial exclusion criterion. Annotated with entity spans:
[Procedure: Gastrectomy], [Procedure: biliopancreatic diversion], [Procedure: resection] or [Procedure: re-routing] of [Qualifier: small intestines]